有一位小兒精神科醫師探討小朋友住院期間，父母親是否在醫院照顧，和小朋友心理焦慮程度的相關性。此研究使用了一個標準化的精神評估量表，評估小朋友的焦慮程度。此研究者在一個研討會報導其研究結果為「不論父母親有沒有在醫院照顧的小孩，他們的焦慮狀態在 5%的顯著水準，沒有達到統計上的顯著」。此研究的結論為：
A. 此檢定有足夠的檢力
B. 此檢定的 p 值小於 0.05
C. 所觀察到兩組小朋友的差異不可能是因為隨機抽樣誤差所造成
D. 此檢定的 p 值大於 0.05

正確答案：D. 此檢定的 p 值大於 0.05